age 18 years or older

The above is a clinical trial inclusion criterion. Annotated with entity spans:
[Person: age] [Value: 18 years or older]